Clinical trial exclusion criterion:
Subjects with known seropositivity to human immunodeficiency virus.

Entity relations:
- Has_value("human immunodeficiency virus", "seropositivity")